Es una situación de ayuno prologado:
1. Se activa la gluconeogénesis hepática.
2. Los cuerpos cetónicos se convierten en la principal fuente de obtención de energía para el hígado.
3. Se inhibe la beta-oxidación de los ácidos grasos en el músculo.
4. En el músculo aumenta la actividad de la piruvato deshidrogenasa (PDH) y la síntesis de glucosa.

Respuesta correcta: 1. Se activa la gluconeogénesis hepática.